Clinical trial exclusion criterion:
Known pregnancy

Annotated entities:
- Condition: "pregnancy"